What is the target of the drug remdesivir?

remdesivir is a polymerase inhibitor